Clinical trial exclusion criterion:
Established Osteoarthritis (Kellgren-Lawrence > 3)

Annotated entities:
- Condition: "Osteoarthritis"
- Measurement: "Kellgren-Lawrence"
- Value: "> 3"